Human immunodeficiency virus (HIV) or human immunodeficiency virus (AIDS)

The above is a clinical trial exclusion criterion. Annotated with entity spans:
[Condition: Human immunodeficiency virus (HIV)] or [Condition: human immunodeficiency virus (AIDS)]